關於成熟的類上皮組織（epithelioid tissue）的細胞之敘述，下列何項錯誤？
A. 有游離表面（free surface）
B. 有側區（lateral domain）
C. 有基底區（basal domain）
D. 基底區與基底膜（basement membrane）接觸

正確答案：A. 有游離表面（free surface）